¿Por qué la carbenicilina presenta una baja actividad antibacteriana por vía oral?:
1. Es degradada por beta-lactamasas en el aparato digestivo.
2. Experimenta metabolismo oxidativo de primer paso hepático.
3. Se une covalentemente a proteínas plasmáticas.
4. Se descarboxila en el medio ácido del estómago dando lugar a bencilpenicilina, que también es inestable en ese medio.
5. Es altamente lipófila, por lo cual no se libera correctamente a partir de las formas de administración oral.

Respuesta correcta: 4. Se descarboxila en el medio ácido del estómago dando lugar a bencilpenicilina, que también es inestable en ese medio.